Clinical trial exclusion criterion:
Known hypersensitivity to the trial treatment(s) or diluents (when applicable), including placebo or other comparator drug(s).

Annotated entities:
- Procedure: "trial treatment(s)"
- Drug: "trial diluents"
- Condition: "hypersensitivity"
- Drug: "placebo"
- Qualifier: "other"
- Drug: "comparator drug(s)"